Clinical trial exclusion criteria:
any medical condition that would contraindicate use of stimulant medication
any prior adverse response to lisdexamfetamine dimesylate or other stimulant medication
use of concurrent,non-stimulant psychoactive medication
diagnosis of schizophrenia or presence of thought disorder symptoms
autism spectrum disorder

Annotated entities:
- Condition: "medical condition"
- Condition: "contraindicate"
- Drug: "stimulant medication"
- Temporal: "prior"
- Condition: "adverse response"
- Drug: "lisdexamfetamine dimesylate"
- Qualifier: "other"
- Drug: "stimulant medication"
- Temporal: "concurrent"
- Drug: "non-stimulant psychoactive medication"
- Condition: "schizophrenia"
- Condition: "thought disorder"
- Mood: "symptoms"
- Condition: "autism spectrum disorder"